下列有關寄生蟲之敘述中，何者錯誤？
A. 除了血吸蟲（schistosomes）外，其他寄生人體的吸蟲類之蟲卵都具有卵蓋（operculum）
B. 野豬是衛氏肺吸蟲（Paragonimus westermani）的保蟲宿主（reservoir host）
C. 生吃美國進口的生鮮蝲蛄（crayfish）有可能感染克氏肺吸蟲（Paragonimus kellicotti）
D. 埃及血吸蟲（Schistosoma haematobium）的慢性感染患者，罹患膀胱癌的機率較高

正確答案：B. 野豬是衛氏肺吸蟲（Paragonimus westermani）的保蟲宿主（reservoir host）